Clinical trial exclusion criterion:
Patients with percutaneous gastric or jejunal feeding tubes already in situ as per Health Canada guidance;

Annotated entities:
- Device: "jejunal feeding tubes"
- Device: "gastric feeding tubes"